HIV co-infection

The above is a clinical trial exclusion criterion. Annotated with entity spans:
[Qualifier: HIV] [Condition: co-infection]